Current diagnosis of otolaryngeal cancer and undergoing surgery with general anesthesia

The above is a clinical trial inclusion criterion. Annotated with entity spans:
Current diagnosis of [Condition: otolaryngeal cancer] and [Temporal: undergoing] [Procedure: surgery] with [Procedure: general anesthesia]